腫瘤細胞在身體內存在並壯大的能力至為驚人，它有許多種方式逃避身體免疫系統的偵查及消滅，而得以繼續長大，這些方式並不包括下列那一項？
A. 引起調節型T（Treg）細胞的增加，進而引起免疫反應之轉向
B. 腫瘤細胞不表現或只有極低的胜肽：人類白血球抗原（peptide：MHC）表現
C. 引起延遲性過敏反應（late phase allergic reaction）而形成腫塊長大
D. 腫瘤抗原雖經抗原呈現細胞（APC）表現給T細胞，但會使T細胞對此抗原不反應

正確答案：C. 引起延遲性過敏反應（late phase allergic reaction）而形成腫塊長大